Clinical trial inclusion criterion:
Patient having received oral and written information on the study, without any objections for the use of his/her personal data, and having signed a written Informed Consent Form.

Annotated entities:
- Non-query-able: "Patient having received oral and written information on the study, without any objections for the use of his/her personal data, and having signed a written Informed Consent Form"